Clinical trial exclusion criterion:
Patient has had a myocardial infarction within last two months.

Annotated entities:
- Condition: "myocardial infarction"
- Temporal: "last two months"